Clinical trial exclusion criterion:
Is pregnant or lactating

Annotated entities:
- Pregnancy_considerations: "Is pregnant or lactating"